2. Have a finding of a mass lesion on ultrasound (BIRADS 0, 4 or 5) that is > 0.5 cm and < 2 cm in size.

The above is a clinical trial inclusion criterion. Annotated with entity spans:
2. Have a finding of a [Condition: mass lesion] on [Procedure: ultrasound] ([Measurement: BIRADS] [Value: 0, 4 or 5]) that is [Value: > 0.5 cm and < 2 cm] in [Measurement: size].